¿Qué tipo de mecanismo propone la Gestalt como mecanismo explicativo para la resolución de un problema?:
1. El ensayo y error.
2. La búsqueda de operaciones en el espacioproblema.
3. Los métodos algorítmicos.
4. Los métodos huerísticos.
5. El insight.

Respuesta correcta: 5. El insight.